下列何者不是細胞內acetyl-CoA的主要來源？
A. fatty acids
B. ketogenic amino acids
C. pyrimidine
D. pyruvate

正確答案：C. pyrimidine